Clinical trial inclusion criterion:
Patients with symptomatic persistent atrial fibrillation of less than 1-year duration.

Entity relations:
- Has_qualifier("atrial fibrillation", "symptomatic")
- Has_qualifier("atrial fibrillation", "persistent")
- Has_temporal("atrial fibrillation", "less than 1-year")